下列功能組成（functional component）的腦幹神經核中，何者最接近中線？
A. 屬一般體傳入（general somatic afferent）
B. 屬一般體傳出（general somatic efferent）
C. 屬一般內臟傳入（general visceral afferent）
D. 屬一般內臟傳出（general visceral efferent）

正確答案：B. 屬一般體傳出（general somatic efferent）